Clinical trial inclusion criterion:
Previous chemotherapy or radiotherapy must have been performed ≥ 8 weeks prior to study entry.

Entity relations:
- Has_temporal("chemotherapy", "Previous")
- Has_temporal("chemotherapy", "≥ 8 weeks prior to study entry")
- OR("chemotherapy", "radiotherapy")